Known positive test(s) for human immunodeficiency virus infection (testing is not required in the absence of clinical suspicion).

The above is a clinical trial exclusion criterion. Annotated with entity spans:
Known [Value: positive] [Measurement: test(s) for human immunodeficiency virus infection] (testing is not required in the absence of clinical suspicion).